Placement of an intrauterine device (IUD) or intrauterine system (IUS)

The above is a clinical trial exclusion criterion. Annotated with entity spans:
Placement of an [Device: intrauterine device] ([Device: IUD]) or [Device: intrauterine system] ([Device: IUS])